linezolid

The above is a clinical trial exclusion criterion. Annotated with entity spans:
[Drug: linezolid]